Intracranial bleed at any point.

The above is a clinical trial exclusion criterion. Annotated with entity spans:
[Condition: Intracranial bleed] [Temporal: at any point].